Clinical trial exclusion criterion:
Established pre-existing diabetes (including unrecognised diabetes defined as a fasting plasma glucose = 7.0mmol/L and/ or HbA1c = 48mmol/mol); Contraindications to metformin therapy (creatinine = 130µmol/L/ alanine transaminase = 2.0 x upper limit normal/ previous intolerance to metformin)

Annotated entities:
- Condition: "diabetes"
- Measurement: "fasting plasma glucose"
- Value: "= 7.0mmol/L"
- Measurement: "HbA1c"
- Value: "= 48mmol/mol)"
- Condition: "Contraindications"
- Drug: "metformin"
- Measurement: "creatinine"
- Value: "= 130µmol/L/"
- Measurement: "alanine transaminase"
- Value: "= 2.0 x upper limit normal"
- Condition: "intolerance"
- Drug: "metformin"